En cuanto a la expresión del receptor de IL-2:
1. Los linfocitos T en reposo expresan la forma de alta afinidad.
2. Los linfocitos T en reposo expresan cadena alfa.
3. Los linfocitos T en reposo expresan el complejo de cadenas bera y gamma común en alta cantidad.
4. Los linfocitos T activados expresan las cadenas alfa, beta y gamma común.

Respuesta correcta: 4. Los linfocitos T activados expresan las cadenas alfa, beta y gamma común.